Clinical trial exclusion criterion:
Any carotid stenting or endarterectomy

Entity relations:
- OR("carotid stenting", "endarterectomy")